Clinical trial inclusion criterion:
20 = Age < 80 years

Annotated entities:
- Value: "20 ="
- Person: "Age"
- Value: "< 80 years"